In the opinion of the attending clinician requires dual anti-platelet therapy with aspirin and a P2Y12 receptor antagonist

The above is a clinical trial inclusion criterion. Annotated with entity spans:
In the opinion of the attending clinician [Mood: requires] [Procedure: dual anti-platelet therapy] with [Drug: aspirin] and a [Drug: P2Y12 receptor antagonist]